Clinical trial exclusion criterion:
Uncontrolled systemic hypertension;

Entity relations:
- Has_qualifier("systemic hypertension", "Uncontrolled")